Medical history, concomitant medications

The above is a clinical trial inclusion criterion. Annotated with entity spans:
[Non-representable: Medical history, concomitant medications]